Clinical trial exclusion criterion:
The indication for oral anticoagulation, associated with others disease.

Entity relations:
- Has_mood("oral anticoagulation", "indication for")